孕婦感染下列何種肝炎病毒最容易發生猛暴性肝炎（fulminant hepatitis）？
A. A 型
B. B 型
C. D 型
D. E 型

正確答案：D. E 型